Clinical trial exclusion criterion:
11. History of severe allergic reactions to any unknown allergens or components of the study drugs.

Annotated entities:
- Parsing_Error: "11."
- Condition: "allergic reactions"
- Qualifier: "severe"
- Temporal: "History"
- Drug: "to any unknown allergens or components of the study drugs"
- Context_Error: "to any unknown allergens or components of the study drugs"